Administration of another investigational drug within 1 month before screening or planned during the study period

The above is a clinical trial exclusion criterion. Annotated with entity spans:
[Competing_trial: Administration of another investigational drug within 1 month before screening or planned during the study period]